Clinical trial exclusion criterion:
inability to take oral medication.

Annotated entities:
- Mood: "inability"
- Drug: "oral medication"